關於X染色體脆折症（fragile X syndrome）的敘述，下列何者錯誤？
A. 發病原因為FMR1（fragile-X mental retardation）基因發生突變，位於Xq27
B. 造成突變的原因為基因出現三核甘酸CGG重複（trinucleotide repeat）次數有異常擴增的現象
C. CGG重複（trinucleotide repeat）次數達44次即會出現智能障礙等臨床症狀
D. 2010年美國婦產科醫學會對於有不明原因智能障礙、發育遲緩、自閉症者或有家族史者，以及卵巢早衰

正確答案：C. CGG重複（trinucleotide repeat）次數達44次即會出現智能障礙等臨床症狀